Informed and signed consent signed by the patient or his / her legal representative.

The above is a clinical trial inclusion criterion. Annotated with entity spans:
[Non-query-able: Informed and signed consent signed by the patient or his / her legal representative].